Clinical trial exclusion criterion:
Planned removal of more than 10 lung lesions

Annotated entities:
- Multiplier: "more than 10"
- Condition: "lung lesions"
- Mood: "Planned"
- Procedure: "removal"